Clinical trial inclusion criterion:
A pre-bronchodilatory forced expiratory flow in 1 second (FEV1) at Visit 1 (Screening) >=80% predicted. There should be no Short acting beta-agonist (SABA) use within 4 hours of this measurement.

Annotated entities:
- Qualifier: "pre-bronchodilatory"
- Measurement: "forced expiratory flow in 1 second (FEV1)"
- Temporal: "at Visit 1 (Screening)"
- Reference_point: "Visit 1 (Screening)"
- Value: ">=80% predicted"
- Drug: "Short acting beta-agonist (SABA)"
- Temporal: "within 4 hours of this measurement"
- Reference_point: "this measurement"
- Negation: "no"